Clinical trial inclusion criterion:
successful left atrial appendage occlusion with Amulet device within 37 days prior to randomization.

Annotated entities:
- Procedure: "left atrial appendage occlusion"
- Qualifier: "successful"
- Device: "Amulet device"
- Temporal: "within 37 days prior to randomization"